75歲的李女士這幾個月來家人發現她都不太喜歡出門，沒有活力，感覺相當健忘、睡得不好、食慾不佳、體重減少、常有呼吸困難、胸口悶、全身不舒服，家人帶她至門診評估。下列敘述何者錯誤？
A. 老年人憂鬱症常伴隨認知功能的症狀，而被認為是「假性失智症」
B. 甲狀腺機能低下或亢進的病人可能都會伴隨憂鬱的症狀，所以懷疑憂鬱的病人應該測量甲狀腺功能
C. 藥物治療6～8週後，大約60～70%的病人可以得到控制
D. SSRI（selective serotonin reuptake inhibitor）類的抗憂鬱藥品比TCA（tricyclic antidepressant）類的藥品更加有效

正確答案：D. SSRI（selective serotonin reuptake inhibitor）類的抗憂鬱藥品比TCA（tricyclic antidepressant）類的藥品更加有效